Clinical trial exclusion criterion:
Women who are pregnant will also be excluded from the study by performing 2 point of care urine pregnancy tests ( prior to vaccinations)

Entity relations:
- Has_multiplier("point of care urine pregnancy tests", "2")
- Has_index("prior to vaccinations", "vaccinations")
- multi("vaccinations", "vaccinations")
- Has_temporal("point of care urine pregnancy tests", "prior to vaccinations")